Known or suspected pregnant women

The above is a clinical trial exclusion criterion. Annotated with entity spans:
[Mood: Known] or [Mood: suspected] [Condition: pregnant] [Person: women]